10歲女生被媽媽帶來門診，她媽媽陳述此小女生自小即常尿濕褲子，而自出生後即持續的包尿布，但此小女生卻很健康快樂，在學校也表現的不錯。此一小女生最有可能罹患什麼病？
A. 應力性尿失禁（stress incontinence）
B. 尿道憩室（urethral diverticula）
C. 膀胱陰道瘻管（vesico vaginal fistula）
D. 輸尿管異位（ectopic ureter）

正確答案：D. 輸尿管異位（ectopic ureter）